Subjects who are immediate candidates for an ICD

The above is a clinical trial exclusion criterion. Annotated with entity spans:
Subjects who are [Temporal: immediate] [Mood: candidates for] an [Procedure: ICD]